Clinical trial inclusion criterion:
3. Subject signs and dates a written informed consent form (ICF) and indicates an understanding of the study procedures.

Annotated entities:
- Post-eligibility: "3. Subject signs and dates a written informed consent form (ICF) and indicates an understanding of the study procedures."